脛骨遠端之重建可以用那一塊 flap？
A. pedicled gastrocnemius flap
B. 游離組織皮瓣移植（free flap transfer）
C. pedicled extensor digitorum longus
D. pedicled sartorius muscle flap

正確答案：B. 游離組織皮瓣移植（free flap transfer）